下列寄生蟲感染，何者不會因幼蟲的移行（migration）而侵犯肺臟？
A. 鞭蟲
B. 蟲
C. 糞小桿線蟲
D. 蛔蟲

正確答案：A. 鞭蟲